History of intolerance to ARB or amlodipine.

The above is a clinical trial exclusion criterion. Annotated with entity spans:
History of [Condition: intolerance] to [Drug: ARB] or [Drug: amlodipine].